¿Cuál de las siguientes actividades NO debe llevarse a cabo en el paciente terminal cuando éste presenta xerostomía?:
1. Ofrecerle pastillas de vitamina C.
2. Darle caramelos con azúcar.
3. Aumentar la ingesta de líquidos.
4. Ofrecerle cubitos de hielo.
5. Prepararle trocitos de piña natural.

Respuesta correcta: 2. Darle caramelos con azúcar.